any condition that would contra-indicate Magnetic Resonance Imaging or administration of contrast agent

The above is a clinical trial exclusion criterion. Annotated with entity spans:
[Undefined_semantics: any condition that would contra-indicate Magnetic Resonance Imaging or administration of contrast agent]